Clinical trial exclusion criterion:
Active substance or alcohol use or dependence that could interfere with participation

Entity relations:
- AND("substance use or dependence", "that could interfere with participation")
- AND("alcohol use or dependence", "that could interfere with participation")
- OR("substance use or dependence", "alcohol use or dependence")